Clinical trial inclusion criterion:
Hemoglobin A1c (HbA1c) = 9%

Entity relations:
- Has_value("Hemoglobin A1c (HbA1c)", "= 9%")